Clinical trial exclusion criterion:
Any use of a very-low-calorie (<1000 calories/day) weight loss diet within 6 months before Screening

Annotated entities:
- Observation: "very-low-calorie weight loss diet"
- Value: "<1000 calories/day"
- Temporal: "within 6 months before Screening"
- Reference_point: "Screening"